Where do the Schwann cells and melanocytes originate from?

Schwann cells and melanocytes originate from the multipotent population of neural crest cells.